Clinical trial inclusion criterion:
High risk for HIV infection

Annotated entities:
- Condition: "HIV infection"
- Mood: "High risk for"